Clinical trial inclusion criterion:
History of AP above ULN for at least six months

Annotated entities:
- Measurement: "AP"
- Value: "above ULN"
- Temporal: "for at least six months"